Clinical trial exclusion criteria:
Patient has history of loose or watery stools
Patient has both clinically significant findings and unexplained clinically significant alarm symptoms
Patient has symptoms of or been diagnosed with a medical condition that may contribute to abdominal pain
Patient has any protocol-excluded or clinically significant medical or surgical history that could confound the study assessments

Annotated entities:
- Condition: "watery stools"
- Condition: "loose stools"
- Temporal: "history of"
- Condition: "clinically significant findings"
- Qualifier: "unexplained"
- Condition: "clinically significant alarm symptoms"
- Condition: "medical condition"
- Qualifier: "may contribute to abdominal pain"
- Condition: "abdominal pain"
- Qualifier: "protocol-excluded"
- Qualifier: "clinically significant"
- Temporal: "surgical history"
- Temporal: "medical history"
- Qualifier: "could confound the study assessments"
- Post-eligibility: "Patient has any protocol-excluded or clinically significant medical or surgical history that could confound the study assessments"